Clinical trial exclusion criterion:
7. Severe left ventricular hypertrophy or severe valvular disease

Annotated entities:
- Parsing_Error: "7."
- Condition: "left ventricular hypertrophy"
- Qualifier: "Severe"
- Condition: "valvular disease"
- Qualifier: "severe"